Clinical trial exclusion criterion:
Patient has any protocol-excluded or clinically significant medical or surgical history that could confound the study assessments

Entity relations:
- Has_qualifier("medical history", "protocol-excluded")
- Has_qualifier("medical history", "could confound the study assessments")
- OR("medical history", "surgical history")
- OR("protocol-excluded", "clinically significant")